Clinical trial exclusion criterion:
anticipation of a required drug test in the 4 weeks following the study.

Annotated entities:
- Temporal: "in the 4 weeks following the study"
- Procedure: "drug test"
- Mood: "anticipation of"